Clinical trial exclusion criterion:
Known or suspected non-compliance, drug or alcohol abuse

Annotated entities:
- Condition: "alcohol abuse"
- Condition: "drug abuse"
- Qualifier: "non-compliance"